下列何者不具有過渡型上皮細胞（transitional epithelium）？
A. 輸尿管（ureter）
B. 膀胱（urinary bladder）
C. 前列腺段尿道（prostatic urethra）
D. 陰莖段尿道（penile urethra）

正確答案：D. 陰莖段尿道（penile urethra）